Clinical trial exclusion criterion:
Associated neuromuscular disorders, contraindication for the use of rocuronium/ sugammadex, allergy or hypersensitivity to rocuronium / sugammadex

Annotated entities:
- Condition: "neuromuscular disorders"
- Condition: "contraindication"
- Drug: "rocuronium"
- Drug: "sugammadex"
- Condition: "allergy"
- Condition: "hypersensitivity"
- Drug: "rocuronium"
- Drug: "sugammadex"